Decompression of the spinal cord following total or partial cervical vertebrectomy

The above is a clinical trial inclusion criterion. Annotated with entity spans:
[Procedure: Decompression of the spinal cord] following [Procedure: total] or [Procedure: partial cervical vertebrectomy]